Clinical trial exclusion criterion:
Baseline systolic blood pressure (SBP) < 100 mmHg

Annotated entities:
- Temporal: "Baseline"
- Measurement: "systolic blood pressure"
- Measurement: "SBP"
- Value: "< 100 mmHg"